Gallbladder carriage is a well recognised means of spread of which bacteria?

Gallbladder carriage is associated with spread of Salmonella Typhi.